What is the function of the TFIIS transcriptional factor (Dst1) in yeast?

Transcription factor IIS (TFIIS) stimulates RNA cleavage by RNA polymerase II by allowing backtracked enzymes to resume transcription elongation. TFIIS promotes the intrinsic ability of RNA polymerase II to cleave the 3'-end of the newly synthesized RNA. Recent studies revealed that TFIIS has also a role in Pol II transcription initiation. TFIIS is required under stress conditions and that TFIIS is important for the transition between initiation and elongation in vivo.